Clinical trial inclusion criterion:
Ritonavir (RTV) to cobicistat (COBI)/COBI-containing fixed-dose combination regimens

Entity relations:
- AND("COBI-containing fixed-dose combination regimens", "cobicistat (COBI)")
- AND("COBI-containing fixed-dose combination regimens", "Ritonavir (RTV)")